70 歲的林先生，是一位第 2 型糖尿病患，最近體檢發現血清肌酸酐值為 2.5 mg/dL，你建議他立即停用那種口服降血糖藥物？
A. pioglitazone
B. glipizide
C. metformin
D. repaglinide

正確答案：C. metformin